中年B型肝炎病人，突然間出現右上腹疼痛、冒冷	、血壓降低且血紅素降低，最可能的診斷是？
A. 肝癌破裂
B. 胰臟發炎
C. 胃食道逆流
D. 胃潰瘍

正確答案：A. 肝癌破裂